Expected survival less than 1 year;

The above is a clinical trial exclusion criterion. Annotated with entity spans:
[Observation: Expected survival] [Value: less than 1 year];